Clinical trial exclusion criterion:
Pregnant, breast-feeding women or women who plan to become pregnant during this study (Females of childbearing potential must have a negative urine pregnancy test)

Entity relations:
- AND("pregnant", "plan to become")
- Has_temporal("plan to become", "during this study")
- Has_value("urine pregnancy test", "negative")
- AND("childbearing potential", "urine pregnancy test")
- AND("Females", "childbearing potential")
- AND("women", "Pregnant")
- AND("women", "pregnant")
- AND("women", "breast-feeding")
- OR("women", "women", "Females")